Poorly regulated diabetes (>200 mg/dl (=11 mmol/l))

The above is a clinical trial exclusion criterion. Annotated with entity spans:
[Qualifier: Poorly regulated] [Condition: diabetes] ([Qualifier: >200 mg/dl (=11 mmol/l)])